Clinical trial inclusion criterion:
Previous exposure to secukinumab or any other biologic drug directly targeting Interleukin-17 (IL-17), Interleukin-12/23 (IL-12/23), or the IL-17 receptor, or any other biologic immunomodulating agent, except those targeting TNFa

Entity relations:
- Has_qualifier("biologic drug", "other")
- Has_negation("TNFa", "except")
- AND("Interleukin-17 (IL-17)", "TNFa")
- AND("targeting", "Interleukin-17 (IL-17)")
- AND("secukinumab", "targeting")
- OR("secukinumab", "biologic drug")
- OR("Interleukin-17 (IL-17)", "Interleukin-12/23 (IL-12/23)", "IL-17 receptor", "biologic immunomodulating agent")